Have had a prior catheter ablation procedure for VT

The above is a clinical trial exclusion criterion. Annotated with entity spans:
Have had a prior [Procedure: catheter ablation procedure] for [Condition: VT]